Clinical trial exclusion criterion:
Patients with knee fusion to the affected joint

Annotated entities:
- Procedure: "knee fusion"